何小姐，18 歲，因腹脹和茶色尿來院門診。理學檢查發現有黃疸和肝臟腫大，實驗室檢查為 AST 1500 U/L，ALT 1600 U/L，膽紅素 5.2 mg/dL，ALP 和 γ-GT 值正常，腹部超音波無異常。下列敘述何者錯誤？
A. 應檢測 IgM anti-HAV
B. 應檢測 IgM anti-HBc
C. 應檢測 IgM anti-HCV
D. 應檢測 ANA（Antinuclear antibody）

正確答案：C. 應檢測 IgM anti-HCV